某case-control study研究某基因型與乳癌的關係，將基因型分為GG+GT與TT兩類，計算得知GG+GT 組比 TT 組的勝算比（Odds Ratio）為 2.4，95%信賴區間（95% Confidence Interval）為（1.4, 4.3）。 下列何者正確？
A. 具 GG+GT 基因型較 TT 型易發生乳癌，有統計上顯著意義
B. 具 GG+GT 基因型較 TT 型不易發生乳癌，有統計上顯著意義
C. 具 GG+GT 基因型較 TT 型易發生乳癌，沒有統計上顯著意義
D. 具 GG+GT 基因型較 TT 型不易發生乳癌，沒有統計上顯著意義

正確答案：A. 具 GG+GT 基因型較 TT 型易發生乳癌，有統計上顯著意義